5. history of surgery on the Achilles tendon or systemic diseases (general inflammatory diseases such as rheumatologic disorders and diabetes)

The above is a clinical trial exclusion criterion. Annotated with entity spans:
5. [Temporal: history] of [Procedure: surgery on the Achilles tendon] or [Condition: systemic diseases] ([Condition: general inflammatory diseases] such as [Condition: rheumatologic disorders] and [Condition: diabetes])